Clinical trial exclusion criterion:
decompensated liver cirrhosis (Child-Pugh score above 6)

Entity relations:
- Has_qualifier("liver cirrhosis", "decompensated")
- Has_value("Child-Pugh score", "above 6")
- Subsumes("decompensated", "Child-Pugh score")